17歲的陳大雄左手腕背面摸到一顆突起腫瘤，媽媽帶他到整形外科門診求診時，醫師會跟他說這顆腫瘤最常見是什麼？
A. 腱鞘囊腫（ganglion cyst）
B. 巨大細胞瘤（giant cell tumor）
C. 脂肪瘤（lipoma）
D. 內生軟骨瘤（enchondroma）

正確答案：A. 腱鞘囊腫（ganglion cyst）